下列何者是單側突眼症（unilateral exophthalmos）發生在小孩最常見的原因？
A. 眼窩血管瘤
B. 眼窩蜂窩組織炎
C. 橫紋肌肉瘤
D. 甲狀腺眼疾（thyroid eye disease）

正確答案：B. 眼窩蜂窩組織炎